Clinical trial exclusion criterion:
Known to be positive for hepatitis C or hepatitis B surface antigen

Entity relations:
- Has_value("hepatitis C", "positive")
- OR("hepatitis C", "hepatitis B surface antigen")